Describe a cytokine release syndrome.

Cytokine release syndrome is characterized by the release of cytokines from the cytosol into the cerebrospinal fluid (CSF) and cytokine production from the sarcoplasmic reticulum (SR).